一位腦中風病人造成患側上下肢與顏面有異常感覺（dysesthesia）與疼痛現象，但運動功能正常，病變最有可能位於下列何處？
A. 小腦（cerebellum）
B. 視丘（thalamus）
C. 橋腦（pons）
D. 延腦（medulla）

正確答案：B. 視丘（thalamus）